下列生殖系統之腫瘤與其病理特徵的組合，何者正確？
A. granulosa cell tumor 與 Schiller-Duval bodies
B. sarcoma botryoides 與 cambium layer
C. yolk sac tumor 與 Call-Exner bodies
D. clear cell adenocarcinoma 與 Reinke crystal

正確答案：B. sarcoma botryoides 與 cambium layer